Clinical trial exclusion criterion:
Recent significant blood donation or plasma donation

Annotated entities:
- Procedure: "blood donation"
- Procedure: "plasma donation"
- Qualifier: "significant"
- Temporal: "Recent"
- Undefined_semantics: "significant"